Clinical trial exclusion criterion:
Patients who'd had previous gastric surgery

Entity relations:
- Has_temporal("gastric surgery", "previous")